當工作環境可能有危害因子存在時，下列何類暴露量管理方式最不宜優先考慮？
A. 以危害性較低物質替代危害性較高物質
B. 使用局部排氣
C. 安排工作輪替以減少暴露時間
D. 配戴個人防護設備

正確答案：D. 配戴個人防護設備